下列何者由梨狀肌（piriformis）的上方進入臀部？
A. 臀上動脈（superior gluteal artery）
B. 臀下動脈（inferior gluteal artery）
C. 坐骨神經（sciatic nerve）
D. 陰部神經（pudendal nerve）

正確答案：A. 臀上動脈（superior gluteal artery）